Karnofskcy performance status (KPS) >_70%.

The above is a clinical trial inclusion criterion. Annotated with entity spans:
[Measurement: Karnofskcy performance status (KPS)] [Value: >_70%].